Clinical trial exclusion criterion:
Active upper GI bleeding within 3 months (90 days) prior to procedure.

Annotated entities:
- Temporal: "Active"
- Condition: "upper GI bleeding"
- Temporal: "within 3 months (90 days) prior to procedure"
- Reference_point: "procedure"